有關adenoid cystic carcinoma of lung之敘述，下列何者正確？①大部分發生於肺周邊組織 ②大部分腫瘤的治療以局部氣管手術切除即可 ③大部分腫瘤都是以局部生長緩慢的氣管支氣管病灶為表現 ④腫瘤絕不會有遠端轉移的現象
A. ①②
B. ②③④
C. ①③④
D. 僅②③

正確答案：D. 僅②③